「做夢（dreaming）」主要出現在下列那一個睡眠週期？
A. stage I
B. stage II
C. stage III
D. 快速動眼期睡眠（REM sleep）

正確答案：D. 快速動眼期睡眠（REM sleep）